Clinical trial exclusion criterion:
History of malignant arrhythmias

Entity relations:
- Has_temporal("malignant arrhythmias", "History")